Age of＜18y or＞75y

The above is a clinical trial exclusion criterion. Annotated with entity spans:
[Person: Age] of[Value: ＜18y or＞75y]